在吸入性麻醉氣體的化學結構中，下列何者非醚鏈結構（ether linkage）？
A. Sevoflurane
B. Halothane
C. Isoflurane
D. Desflurane

正確答案：B. Halothane